Clinical trial inclusion criterion:
Developed side effects within 2 weeks of initiation

Annotated entities:
- Condition: "side effects"
- Temporal: "within 2 weeks of initiation"
- Reference_point: "initiation"